有關攝護腺肥大（BPH）之敘述，下列何者錯誤？
A. Tamsulosin 是目前最強的α1拮抗劑
B. 約有 30% BPH 之病患同時有高血壓存在
C. 以 Finasteride 治療 BPH 時，其體積縮小之最大效果發生在 3 個月內
D. α1a接受器為攝護腺平滑肌之主要接受器

正確答案：C. 以 Finasteride 治療 BPH 時，其體積縮小之最大效果發生在 3 個月內